Inability to use the PCA device.

The above is a clinical trial exclusion criterion. Annotated with entity spans:
[Condition: Inability] to [Procedure: use the PCA] device.